Free of psychoactive medication for at least: one month for fluoxetine; two weeks for other SSRIs and neuroleptics; and five days for stimulants prior to MRI scanning [excepting stable doses (greater than three months duration) of anticonvulsant medication for seizure disorder]

The above is a clinical trial inclusion criterion. Annotated with entity spans:
[Negation: Free of] [Drug: psychoactive medication] for [Temporal: at least]: one month for [Drug: fluoxetine]; two weeks for other [Drug: SSRIs] and [Drug: neuroleptics]; and five days for [Drug: stimulants] [Temporal: prior to MRI scanning] [[Negation: excepting] [Qualifier: stable doses] ([Temporal: greater than three months] duration) of [Drug: anticonvulsant medication] for [Condition: seizure disorder]]